Clinical trial exclusion criterion:
History of alcohol or drug dependence or abuse

Entity relations:
- Has_temporal("alcohol dependence", "History")
- OR("alcohol dependence", "drug dependence", "drug abuse", "alcohol abuse")